下列那一種病毒不是藉由呼吸道傳播？
A. 鼻病毒（rhinoviruses）
B. 冠狀病毒（coronaviruses）
C. 水痘病毒（chicken pox viruses）
D. C 型肝炎病毒（HCV）

正確答案：D. C 型肝炎病毒（HCV）